慢性病毒性肝炎病人若長期酗酒，以下列何者最易造成肝硬化？
A. B 型
B. C 型
C. D 型
D. E 型

正確答案：B. C 型